45歲女性病患來門診時，主訴疲倦（malaise），鞏膜泛黃（icteric sclera），急診檢	資料顯示血清 albumin level：3.6 g/dL（reference value＞3.5），total bilirubin level：5.6 mg/dL（reference value＜
 1.0），direct bilirubin level：2.4 mg/dL（reference value＜0.3），ALT level 1240 U/L（reference value＜ 40），AST level 1380 U/L（reference value＜40），ALP level 89 U/L（reference value＜100），PT INR  6（reference value 0.9～1.1），請依前述情況回答下列3題。以下何項訊息對病情診斷沒有幫助？
A. 藥物史（drug history）
B. 抽菸史（smoking history）
C. 過去肝炎病史（previous hepatitis history）
D. 接觸危險行為史（exposure to risk behavior history）

正確答案：B. 抽菸史（smoking history）